Un paciente diagnosticado de insuficiencia renal crónica presenta hormigueo y parestesias en las piernas. Esto es debido a:
1. Alteraciones vasculares producidas por hiperlipidemia.
2. Neuropatía periférica asociada a la uremia.
3. Hiperfosfatemia secundaria a la osteodistrofia renal.
4. Disminución de perfusión periférica a consecuencia de la anemia.
5. Hipercalcemia producida por la disminución del filtrado glomerular.

Respuesta correcta: 2. Neuropatía periférica asociada a la uremia.